pre-operatory hypoalbuminemy

The above is a clinical trial exclusion criterion. Annotated with entity spans:
[Qualifier: pre-operatory] [Condition: hypoalbuminemy]